What is another name for the plant Sideritis scardica?

Sideritis scardica is also known as ironwort or mountain tea.